De todos los grupos de medicamentos que se relacionan a continuación, los que con menor frecuencia provocan una reacción anafiláctica en el paciente son:
1. Los AINEs.
2. Los analgésicos opiáceos.
3. Los medios de contraste que contienen yodo, utilizados para las exploraciones radiológicas.
4. Las benzodiacepinas.
5. Los antibióticos, especialmente penicilinas, cefalosporinas y sulfonamidas.

Respuesta correcta: 4. Las benzodiacepinas.